En la clasificación de los trastornos mentales y del comportamiento (CIE-10), el grupo “Trastornos neuróticos, secundarios a situaciones estresante y somatomorfos”, está comprendido por los trastornos de ansiedad fóbica, otros trastornos de ansiedad, el trastorno obsesivocompulsivo, las reacciones a estrés grave y de adaptación, otros trastornos neuróticos y ¿cuál o cuáles de los siguientes?
1. Los trastornos somatomorfos.
2. Los trastornos disociativos.
3. Los episodios depresivos maníacos.
4. Los trastornos disociativos y los trastornos somatomorfos.
5. El trastorno bipolar.

Respuesta correcta: 4. Los trastornos disociativos y los trastornos somatomorfos.